Clinical trial inclusion criterion:
Present to ED primary for management of LBP, defined as pain originating between the lower border of the scapulae and the upper gluteal folds. Flank pain, that is pain originating from tissues lateral to the paraspinal muscles, will not be included.

Entity relations:
- AND("Present", "ED")
- AND("ED", "LBP")
- Has_qualifier("pain", "between the lower border of the scapulae and the upper gluteal folds")
- Subsumes("Present", "pain")
- Has_qualifier("pain", "tissues lateral to the paraspinal muscles")
- Subsumes("Flank pain", "pain")
- Has_negation("Flank pain", "not")